有關白喉桿菌（Corynebacterium diphtheriae）的敘述，下列何者正確？
A. 耐酸性染色陽性為一重要診斷依據
B. 人類是唯一的天然宿主
C. 攜帶白喉毒素（diphtheria toxin）的基因位於質體上
D. 還沒有疫苗可預防

正確答案：B. 人類是唯一的天然宿主